某醫院最近引進一家不同廠商的外科耗材，但在不到3個月便把這項耗材剔除，原因是醫院發現，該耗材用量異常增加，因為廠商私下付給使用該耗材的醫師每件500元。下列何者非為本案例中可能涉及的倫理議題？
A. 損及醫病互信
B. 違反病人隱私
C. 造成醫療資源浪費
D. 存有利益衝突

正確答案：B. 違反病人隱私